Evident local or pelvic recurrence

The above is a clinical trial exclusion criterion. Annotated with entity spans:
Evident [Condition: local] or [Condition: pelvic recurrence]